食物中黴菌毒素之特性為何？
A. 通常穩定且耐熱
B. 極易在酸性下破壞
C. 經加溫 70℃即可破壞
D. 高溫至 100℃即可破壞

正確答案：A. 通常穩定且耐熱